Clinical trial inclusion criterion:
patient hospitalized in critical care units

Annotated entities:
- Procedure: "hospitalized"
- Visit: "critical care units"